Clinical trial inclusion criterion:
Developed side effects within 2 weeks of initiation

Entity relations:
- Has_index("within 2 weeks of initiation", "initiation")
- Has_temporal("side effects", "within 2 weeks of initiation")